Female sterilization (have had surgical bilateral oophorectomy with or without hysterectomy) or tubal ligation at least six weeks before taking study treatment. In case of oophorectomy alone, only when the reproductive status of the woman has been confirmed by follow up hormone level assessment

The above is a clinical trial exclusion criterion. Annotated with entity spans:
[Procedure: Female sterilization] (have had surgical [Procedure: bilateral oophorectomy] with or without [Procedure: hysterectomy]) or [Procedure: tubal ligation] [Temporal: at least six weeks before taking study treatment]. [Non-query-able: In case of oophorectomy alone, only when the reproductive status of the woman has been confirmed by follow up hormone level assessment]